Clinical trial inclusion criteria:
Patients undergoing total knee arthroplasty under spinal anaesthesia
45y or older
ASA 1-3
BMI 18-35

Annotated entities:
- Procedure: "total knee arthroplasty"
- Procedure: "spinal anaesthesia"
- Value: "45 or older"
- Person: "y"
- Measurement: "ASA"
- Value: "1-3"
- Measurement: "BMI"
- Value: "18-35"